Clinical trial exclusion criterion:
History of disabling neurological or psychiatric condition such as epilepsy, multiple sclerosis, cortical stroke, hypoxic-ischemic encephalopathy, encephalitis, or schizophrenia

Entity relations:
- OR("epilepsy", "encephalitis", "hypoxic-ischemic encephalopathy", "cortical stroke", "multiple sclerosis", "schizophrenia")